history of major systemic illness, including uncontrolled hypertension, diabetes, chronic renal insufficiency, autoimmune diseases or malignancies

The above is a clinical trial exclusion criterion. Annotated with entity spans:
history of [Qualifier: major] [Condition: systemic illness], including [Qualifier: uncontrolled] [Condition: hypertension], [Condition: diabetes], [Condition: chronic renal insufficiency,] [Condition: autoimmune diseases] or [Condition: malignancies]